下列何種指標最不常用於臨床上評估腦傷（traumatic brain injury）病人的預後？
A. 腦傷後癲癇（seizure）的發生頻率
B. 昏迷（duration of coma）時間的長短
C. 格拉司哥氏昏迷指數（Glasgow coma scale）
D. 腦傷後失憶（amnesia）時間的長短

正確答案：A. 腦傷後癲癇（seizure）的發生頻率